Clinical trial inclusion criterion:
Able to perform some small wrist flexion and extension

Entity relations:
- Has_mood("small wrist flexion and extension", "Able to")